Presence of local inflammation and/or infection;

The above is a clinical trial exclusion criterion. Annotated with entity spans:
Presence of [Condition: local inflammation] and/or infection;